Clinical trial exclusion criterion:
Heavy alcoholics

Annotated entities:
- Qualifier: "Heavy"
- Condition: "alcoholics"